What is the phenomenon of gene kissing?

This positioning can also result in the clustering of genes with similar expression patterns, a phenomenon sometimes called "gene kissing." We speculate that our findings might provide insight into other types of gene kissing, some of which also require cis-acting DNA sequences and trans-acting proteins.